Investigator discretion

The above is a clinical trial exclusion criterion. Annotated with entity spans:
[Non-query-able: Investigator discretion]